Clinical trial inclusion criterion:
Person is walking on average 1km/day.

Entity relations:
- Has_multiplier("walking", "1km/day")